Clinical trial exclusion criterion:
Severe bronchial asthma or severe chronic obstructive pulmonary disease.

Entity relations:
- Has_qualifier("chronic obstructive pulmonary disease", "severe")
- Has_qualifier("bronchial asthma", "Severe")
- OR("bronchial asthma", "chronic obstructive pulmonary disease")